有關頸椎疾病復健治療原則的敘述，下列何者錯誤？
A. 脊髓病變是頸椎牽引的適應症
B. 可用 Transcutaneous electrical nerve stimulation（TENS）來止痛
C. 咳嗽、打噴嚏可能加重頸神經根病變之症狀
D. 抬高同側之肱骨可能會減輕神經根病變之症狀

正確答案：A. 脊髓病變是頸椎牽引的適應症